Clinical trial exclusion criterion:
History of diseases with influence on bone metabolism such as Paget's disease and primary hyperparathyroidism

Entity relations:
- AND("History", "diseases with influence on bone metabolism")
- OR("diseases with influence on bone metabolism", "primary hyperparathyroidism", "Paget's disease")